下列關於thyroid storm治療的敘述，何者錯誤？
A. Lugol's iodine含有大量的碘，應避免使用
B. ß-blockers可減少peripheral T4 to T3 conversion
C. propylthiouracil（PTU）可減少peripheral conversion of T4 to T3
D. 應給予氧氣及靜脈輸液補充

正確答案：A. Lugol's iodine含有大量的碘，應避免使用